Person who weighs less than 50kg.

The above is a clinical trial exclusion criterion. Annotated with entity spans:
Person who [Person: weighs] [Value: less than 50kg].